Clinical trial exclusion criterion:
age less than 13 years at time of procedure

Annotated entities:
- Person: "age"
- Value: "less than 13 years"
- Temporal: "at time of procedure"